Amiodarone

The above is a clinical trial exclusion criterion. Annotated with entity spans:
[Drug: Amiodarone]